Clinical trial exclusion criterion:
Patient less than age 4 years

Annotated entities:
- Value: "less than 4 years"
- Person: "age"